Clinical trial exclusion criterion:
less than 18 years of age of more than 80 years of age

Annotated entities:
- Person: "age"
- Value: "less than 18 years"
- Person: "age"
- Value: "more than 80 years"